Clinical trial exclusion criterion:
Having life expectancy less than 1 year

Entity relations:
- Has_value("life expectancy", "less than 1 year")